Subacute and chronic atopic subjects who have atopic dermatitis symptoms continually at least 6 months

The above is a clinical trial inclusion criterion. Annotated with entity spans:
[Qualifier: Subacute] [Grammar_Error: and] [Qualifier: chronic] atopic subjects who have atopic [Condition: dermatitis symptoms] [Temporal: continually at least 6 months]